List proteins with HEAT repeats

mTOR,
TOG5, 
DNA-PKcs,
HEATR1,
Rif1,
B56γ,
PR65/A,
SF3b155,
Pds5B